(1) cases of infertility, older than 20 years of age and not older than 40 years.

The above is a clinical trial inclusion criterion. Annotated with entity spans:
(1) cases of [Condition: infertility], [Value: older than 20 years] of [Person: age] and [Value: not older than 40 years].